Clinical trial exclusion criterion:
Total bilirubin > 3 mg/dL.

Entity relations:
- Has_value("Total bilirubin", "> 3 mg/dL")